Clinical trial exclusion criterion:
Acute infection/inflammation (Temperature > 101.5 F, and/or WBC> 15, 000)

Annotated entities:
- Qualifier: "Acute"
- Condition: "infection"
- Condition: "inflammation"
- Measurement: "Temperature"
- Measurement: "WBC"
- Value: "> 101.5 F"
- Value: "> 15, 000"